某老先生中風後發生右邊半身不遂與吞嚥困難，他可以喝水但吞嚥半固體或固體食物時有困難。下列何種處置最能改善其吞嚥功能？
A. 將頭轉向一側
B. 吞嚥前先閉氣
C. 環咽擴張術（cricopharyngeal dilatation）
D. 增加流質濃稠度（thicken liquids）

正確答案：C. 環咽擴張術（cricopharyngeal dilatation）